Clinical trial exclusion criterion:
major illness or congenital anomaly

Annotated entities:
- Condition: "major illness"
- Condition: "congenital anomaly"